Clinical trial exclusion criterion:
Significant valve disease (severe aortic stenosis or regurgitation; severe mitral regurgitation)

Annotated entities:
- Condition: "valve disease"
- Qualifier: "severe"
- Condition: "aortic stenosis"
- Condition: "regurgitation"
- Condition: "mitral regurgitation"
- Qualifier: "severe"